Clinical trial inclusion criterion:
at least 6 weeks after surgical sterilization by bilateral tubal ligation or bilateral oophorectomy

Annotated entities:
- Procedure: "surgical sterilization"
- Procedure: "bilateral tubal ligation"
- Procedure: "bilateral oophorectomy"
- Temporal: "at least 6 weeks"